下列有關小腸的敘述，何者錯誤？
A. 空腸壁較迴腸壁厚
B. 空腸繫膜上的弓狀動脈（arterial arcade）較迴腸多
C. 空腸的環狀皺壁（plicae circulares）較迴腸多
D. 迴腸壁有聚集的淋巴組織（Peyer's patch）

正確答案：B. 空腸繫膜上的弓狀動脈（arterial arcade）較迴腸多